Clinical trial exclusion criterion:
Any disorder which, in the opinion of the investigator, might jeopardise subject's safety or compliance with the protocol.

Annotated entities:
- Post-eligibility: "Any disorder which, in the opinion of the investigator, might jeopardise subject's safety or compliance with the protocol."